History of recent gastro-intestinal bleeding

The above is a clinical trial exclusion criterion. Annotated with entity spans:
History of [Temporal: recent] [Condition: gastro-intestinal bleeding]